Allergic to or intolerant of investigational medications

The above is a clinical trial exclusion criterion. Annotated with entity spans:
[Condition: Allergic] to or [Condition: intolerant] of [Drug: investigational medications]